Clinical trial exclusion criterion:
Weigh >300 lbs

Entity relations:
- Has_value("Weigh", ">300 lbs")